renal function impairment (serum creatinine >1.5 mg/dl), Fanconi syndrome

The above is a clinical trial exclusion criterion. Annotated with entity spans:
[Condition: renal function impairment] ([Measurement: serum creatinine] [Value: >1.5 mg/dl]), [Condition: Fanconi syndrome]